Clinical trial exclusion criterion:
Affected by systemic diseases recognized to severely affect bone metabolism (e.g. Cushing's syndrome, Addison's disease, diabetes mellitus type 1, leukaemia, pernicious anaemia, malabsorption syndromes, chronic liver disease, rheumatoid arthritis).

Entity relations:
- OR("Cushing's syndrome", "chronic liver disease", "malabsorption syndromes", "pernicious anaemia", "leukaemia", "diabetes mellitus type 1", "Addison's disease", "rheumatoid arthritis")